Clinical trial inclusion criterion:
Subject with a total serum testosterone level = 300 ng/dL, with or without supplementation

Annotated entities:
- Measurement: "total serum testosterone level"
- Value: "= 300 ng/dL"